Currently taking any psychotropic medications

The above is a clinical trial exclusion criterion. Annotated with entity spans:
[Temporal: Currently] taking any [Drug: psychotropic medications]